下列何種情況不屬於腸病毒重症的特徵？
A. 發病超過7天
B. 出現類似驚嚇的全身性肢體抽動伴有心跳快或血壓高
C. 年齡小於5歲
D. 持續嘔吐

正確答案：A. 發病超過7天